Women

The above is a clinical trial inclusion criterion. Annotated with entity spans:
[Person: Women]